Clinical trial inclusion criterion:
Spinal pain as measured by BASDAI question #2 = 4 cm (0-10 cm) at baseline

Entity relations:
- Has_value("BASDAI question #2", "= 4 cm")
- Has_temporal("BASDAI question #2", "at baseline")
- AND("Spinal pain", "BASDAI question #2")